50歲男性，自1年前開始，左手做動作時會出現不自主的抽動、半年後左側肢體動作開始變的不靈活，且合併智力衰退等症狀，神經檢查出現肌躍症及肌張力不全，左手對針刺激特別敏感，但若讓他用左手摸硬幣或鑰匙、病人無法辨識，且常抱怨自己的左手像外星人的手。最可能的診斷為何？
A. 多發系統退化症（multiple system atrophy）
B. 巴金森病（Parkinson disease）
C. 皮質基底核退化症（corticobasal ganglionic degeneration）
D. 漸進性上核麻痺症（progressive supranuclear palsy）

正確答案：C. 皮質基底核退化症（corticobasal ganglionic degeneration）